Subjects taking the following medications for at least six weeks, which may interfere with the study, will be excluded: BAS, antibiotics, anticoagulants, anticonvulsants, antiarrhythmic, Cyclosporine, Mycophenolate and Synthroid. Subjects with chronic diarrhea, gastric bypass or lap band procedures, ostomies, bowel motility problems, or other conditions that could affect intestinal fat absorption.

The above is a clinical trial exclusion criterion. Annotated with entity spans:
Subjects taking the following medications [Temporal: for at least six weeks], which may interfere with the study, will be excluded: [Drug: BAS], [Drug: antibiotics], [Drug: anticoagulants], [Drug: anticonvulsants], [Drug: antiarrhythmic], [Drug: Cyclosporine], [Drug: Mycophenolate] [Grammar_Error: and] [Drug: Synthroid]. Subjects with [Condition: chronic diarrhea], [Procedure: gastric bypass] or [Procedure: lap band procedures], [Procedure: ostomies], [Condition: bowel motility problems], or other [Condition: conditions that could affect intestinal fat absorption].